Idarucizumab is an antidote of which drug?

Idarucizumab is an antidote of Dabigatran. It is used for Dabigatran Reversal.